關於精神分裂症的敘述，下列何者錯誤？
A. 終身盛行率約為百分之一
B. 在兒童青少年期發病者預後較差
C. 可能合併出現憂鬱或強迫症狀
D. 幻聽是必要診斷條件

正確答案：D. 幻聽是必要診斷條件